current psychosis

The above is a clinical trial exclusion criterion. Annotated with entity spans:
[Temporal: current] [Condition: psychosis]